Ability and willingness to provide informed consent

The above is a clinical trial inclusion criterion. Annotated with entity spans:
[Informed_consent: Ability and willingness to provide informed consent]